Las quinolonas son compuestos antibacterianos que tienen como diana:
1. La subunidad 50 S del ribosoma bacteriano.
2. La membrana plasmática.
3. La enzima DNA polimerasa.
4. La enzima RNA polimerasa.
5. La enzima DNA girasa.

Respuesta correcta: 5. La enzima DNA girasa.